Clinical trial inclusion criterion:
Scheduled for elective Cesarean Delivery

Annotated entities:
- Mood: "Scheduled for"
- Qualifier: "elective"
- Procedure: "Cesarean Delivery"